關於小腿的四個腔室，下列敘述何者錯誤？
A. 前腔室（anterior compartment）的肌肉包含脛前肌（tibialis anterior）、伸長肌（extensor hallucis longus）、伸趾長肌（extensor digitorum longus）及第三腓骨肌（peroneus tertius）
B. 淺腓骨神經（superficial peroneal nerve）位於側腔室（lateral compartment）
C. 淺後腔室（superficial posterior compartment）的肌肉包含屈趾長肌（flexor digitorum longus）、屈
D. 脛後動脈（posterior tibial artery）及脛後神經（posterior tibial nerve）位於深後腔室（deep posterior

正確答案：C. 淺後腔室（superficial posterior compartment）的肌肉包含屈趾長肌（flexor digitorum longus）、屈